有關睪丸的組織顯微結構與功能的配對，下列何者最為恰當？
A. Leydig cell位於曲細精管（seminiferous tubule）之內；分泌睪固酮（testosterone）
B. Sertoli cell位於曲細精管（seminiferous tubule）之外； 曲細精管收縮
C. Sertoli cell位於曲細精管（seminiferous tubule）之內；精子（sperm）的分化和成熟
D. Leydig cell位於曲細精管（seminiferous tubule）之內；精子（sperm）的營養供應

正確答案：C. Sertoli cell位於曲細精管（seminiferous tubule）之內；精子（sperm）的分化和成熟